Clinical trial inclusion criterion:
Subject has other medical or surgical conditions which would preclude the potential benefit of surgery, such as congenital abnormalities, immunosuppressive disease, elevation of sedimentation rate unexplained by other diseases, elevation of white blood count (WBC), or marked left shift in the WBC differential count.

Entity relations:
- Has_value("sedimentation rate", "elevation")
- Has_value("white blood count (WBC)", "elevation")
- Has_value("WBC differential count", "left shift")
- Has_qualifier("sedimentation rate", "unexplained by other diseases")
- OR("immunosuppressive disease", "sedimentation rate", "white blood count (WBC)", "WBC differential count")